an intention of H. pylori eradication treatment and have written inform consent

The above is a clinical trial inclusion criterion. Annotated with entity spans:
[Informed_consent: an intention of H. pylori eradication treatment and have written inform consent]